Meets Diagnostic and Statistical Manual of Mental Disorders (Versions 4 and 5) criteria for and Major Depressive Disorder.

The above is a clinical trial inclusion criterion. Annotated with entity spans:
Meets [Measurement: Diagnostic and Statistical Manual of Mental Disorders] ([Qualifier: Versions 4] [Parsing_Error: and] 5) criteria for [Parsing_Error: and] [Condition: Major Depressive Disorder].